A known contraindication or hypersensitivity to all anticoagulation regimens, or inability to be anticoagulated for the study procedure.

The above is a clinical trial exclusion criterion. Annotated with entity spans:
A known [Condition: contraindication] or [Condition: hypersensitivity] to all [Procedure: anticoagulation regimens], or [Condition: inability] to be [Procedure: anticoagulated] [Temporal: for the study procedure].